La terapia interpersonal es uno de los tratamientos de elección para los casos de:
1. Anorexia nerviosa.
2. Bulimia nerviosa.
3. Obesidad con atracones (sobre todo para la pérdida de peso).
4. Rumiación.

Respuesta correcta: 2. Bulimia nerviosa.